1. Are unable to understand and sign the consent form

The above is a clinical trial exclusion criterion. Annotated with entity spans:
1. [Non-query-able: Are unable to understand and sign the consent form]